Clinical trial exclusion criterion:
ASA 4 or 5

Annotated entities:
- Measurement: "ASA"
- Value: "4 or 5"